What is adhesive capsulitis

Adhesive capsulitis also known as "frozen shoulder" is characterized by painful, gradual loss of active and passive shoulder motion resulting from fibrosis and contracture of the joint capsule.